Current or previous, within the 60 days preceding the baseline visit (Visit 2), treatment with antimuscarinic agents for OAB symptoms; and, willingness to not use antimuscarinic agents for the duration of the study.

The above is a clinical trial exclusion criterion. Annotated with entity spans:
Current or previous, [Temporal: within the 60 days preceding the baseline visit] (Visit 2), treatment with [Drug: antimuscarinic agents] for [Condition: OAB symptoms]; and, [Post-eligibility: willingness to not use antimuscarinic agents for the duration of the study].